Clinical trial exclusion criterion:
creatinine > 2,5 mg/dl

Annotated entities:
- Measurement: "creatinine"
- Value: "> 2,5 mg/dl"